La terapia psicológica integral (IPT) de Brenner y colaboradores (1992) está formada por diferentes subprogramas ¿Cuál de estos subprogramas NO pertenece a dicha terapia?:
1. Diferenciación cognitiva.
2. Solución de problemas interpersonales.
3. Percepción social.
4. Habilidades sociales.
5. Manejo y control del estrés.

Respuesta correcta: 5. Manejo y control del estrés.